Patients with end-stage renal disease(ESRD)/chronic kidney disease(CKD)stage 5

The above is a clinical trial inclusion criterion. Annotated with entity spans:
Patients with [Condition: end-stage renal disease]([Condition: ESRD])/[Condition: chronic kidney disease]([Condition: CKD])[Qualifier: stage 5]